Scheduled for elective video-assisted thoracic surgery

The above is a clinical trial inclusion criterion. Annotated with entity spans:
[Mood: Scheduled for] [Qualifier: elective] [Procedure: video-assisted thoracic surgery]